下列何種情況下的腦室擴張可稱為代償性水腦症（hydrocephalus ex vacuo）？
A. 巨細胞病毒腦炎（CMV encephalitis）
B. 脈絡叢乳突瘤（choroid plexus papilloma）
C. 老年失智症（senile dementia）
D. 先天性導水管狹窄（congenital stenosis of aqueduct）

正確答案：C. 老年失智症（senile dementia）